Clinical trial inclusion criterion:
diagnosed with stable chronic heart failure NYHA class II-III

Entity relations:
- Has_value("NYHA class", "II-III")
- Has_qualifier("chronic heart failure", "stable")
- AND("chronic heart failure", "NYHA class")